由於胚體快速的成長，所以造成橫膈背部（dorsal part of diaphragm）的最終位置，相當於下列那一椎骨的高 度？
A. T8
B. T10
C. L1
D. L3

正確答案：C. L1